Clinical trial inclusion criterion:
SCI ( 2 months of injury)

Annotated entities:
- Condition: "SCI"
- Temporal: "2 months of injury"